Clinical trial exclusion criterion:
Known or suspected sensitivity to Dexamethasone Acetate (DXA)

Annotated entities:
- Condition: "sensitivity to Dexamethasone Acetate (DXA)"
- Drug: "Dexamethasone Acetate (DXA)"
- Observation: "suspected"
- Observation: "Known"